Clinical trial inclusion criterion:
Free from chronic disease e.g. malignancy requiring frequent medical attention (as from the Ante-natal card)

Entity relations:
- Subsumes("chronic disease", "malignancy")